Active infection requiring systemic treatment or any uncontrolled infection <=14 days prior to first dose of study treatment (with the exception of uncomplicated urinary tract infection or upper respiratory tract infection).

The above is a clinical trial exclusion criterion. Annotated with entity spans:
[Temporal: Active] [Condition: infection] requiring [Procedure: systemic treatment] or [Qualifier: any] [Condition: uncontrolled infection] [Temporal: <=14 days prior to first dose of study treatment] ([Negation: with the exception of] [Qualifier: uncomplicated] [Condition: urinary tract infection] or [Condition: upper respiratory tract infection]).